Documentation of the presence of an acute pulmonary exacerbation, based on CF Foundation guidelines, as diagnosed by a faculty member of the Denver Adult CF Program.

The above is a clinical trial inclusion criterion. Annotated with entity spans:
Documentation of the presence of an [Condition: acute pulmonary exacerbation], based on [Measurement: CF Foundation guidelines], [Non-query-able: as diagnosed by a faculty member of the Denver Adult CF Program].